Clinical trial inclusion criterion:
History of previous myocardial infarction (MI)

Entity relations:
- Subsumes("myocardial infarction", "MI")